Clinical trial inclusion criterion:
First or second single kidney (cadaveric or living donors) transplant recipients.

Entity relations:
- Has_qualifier("First single kidney transplant", "cadaveric donors")
- Has_qualifier("transplant second single kidney", "cadaveric donors")
- OR("First single kidney transplant", "transplant second single kidney")
- OR("cadaveric donors", "living donors")